有關口腔黏膜變化的敘述，下列何者正確？
A. 口腔白斑（leukoplakia）主要變化是口腔黏膜上皮層萎縮
B. 口腔白斑惡性變化的可能性較口腔紅斑（erythroplakia）為高
C. 扁平苔蘚（lichen planus）雖然是一種自體免疫病灶，也有惡性變化的可能
D. 口腔黏膜下纖維化（submucosal fibrosis）是一種發炎性病灶，不會產生惡性變化

正確答案：C. 扁平苔蘚（lichen planus）雖然是一種自體免疫病灶，也有惡性變化的可能